Clinical trial exclusion criterion:
Current therapy with Insulin, thiazolidinediones, steroids or atypical antipsychotic medication

Entity relations:
- OR("Insulin", "thiazolidinediones", "steroids", "atypical antipsychotic medication")